Clinical trial inclusion criteria:
Males and females who are at least 18 years of age at time of enrollment.
Subject understands the investigational nature of the study and provides written, informed consent.

Annotated entities:
- Person: "Males"
- Person: "females"
- Value: "at least 18 years"
- Person: "age"
- Temporal: "at time of enrollment"
- Reference_point: "time of enrollment"
- Post-eligibility: "Subject understands the investigational nature of the study and provides written, informed consent."